La solubilidad del fluoruro de calcio en una disolución de pH<3 es mayor que en agua pura debido a:
1. La ausencia de reacciones de formación de complejos hidroxilados de calcio a esos valores de pH.
2. La menor capacidad de hidratación de las partículas de precipitado a esos valores de pH.
3. La ausencia de reacciones de formación de complejos solubles de calcio y fluoruro a esos valores de pH.
4. Las reacciones de formación de complejos del ion Ca2+ con el hidronio.
5. La reacción de protonación del anión fluoruro.

Respuesta correcta: 5. La reacción de protonación del anión fluoruro.